Clinical trial inclusion criterion:
Patients with central nervous system disease are eligible for enrollment if they have received prior radiotherapy or surgery to sites of CNS metastatic disease and are without evidence of clinical progression for at least 4 weeks prior to screening, have no evidence of new or enlarging brain metastases, and are off steroids for at least 7 days before first dose of pembrolizumab.

Entity relations:
- AND("surgery", "CNS metastatic disease")
- AND("radiotherapy", "CNS metastatic disease")
- Has_negation("clinical progression", "without")
- Has_index("for at least 4 weeks prior to screening", "screening")
- Has_temporal("clinical progression", "for at least 4 weeks prior to screening")
- Has_qualifier("brain metastases", "new")
- Has_negation("brain metastases", "no")
- Has_negation("steroids", "off")
- AND("first dose of pembrolizumab", "pembrolizumab")
- Has_index("for at least 7 days before first dose of pembrolizumab", "first dose of pembrolizumab")
- Has_temporal("steroids", "for at least 7 days before first dose of pembrolizumab")
- AND("central nervous system disease", "radiotherapy")
- AND("central nervous system disease", "clinical progression")
- AND("central nervous system disease", "brain metastases")
- AND("central nervous system disease", "steroids")
- OR("radiotherapy", "surgery")
- OR("new", "enlarging")